Active uncontrolled infection requiring antibiotics.

The above is a clinical trial exclusion criterion. Annotated with entity spans:
[Qualifier: Active uncontrolled] [Condition: infection] requiring [Drug: antibiotics].